Willing and able to provide informed written consent

The above is a clinical trial inclusion criterion. Annotated with entity spans:
[Post-eligibility: Willing and able to provide informed written consent]